Clinical trial exclusion criterion:
Known bleeding disorder (e.g,. dysfibrinogenemia, factor IX deficiency, hemophilia, Von Willebrand's disease, disseminated intravascular coagulation (DIC), fibrinogen deficiency, or clotting factor deficiency)

Annotated entities:
- Condition: "bleeding disorder"
- Condition: "dysfibrinogenemia"
- Condition: "factor IX deficiency"
- Condition: "hemophilia"
- Condition: "Von Willebrand's disease"
- Condition: "disseminated intravascular coagulation"
- Condition: "DIC"
- Condition: "fibrinogen deficiency"
- Condition: "clotting factor deficiency"